What is the mechanism of action of Fremanezumab?

Fremanezumab is a monoclonal antibody directed against calcitonin-gene-related peptide (CGRP). It was shown to be effective for migraine preventive therapy. Other three monoclonal antibodies targeting the CGRP pathway are eptinezumab, erenumab and galcanezumab.